小王是中學的田徑校隊選手，不幸因為車禍而導致右小腿截肢，下列那一種義足最適合他繼續運動？
A. 沙奇式（SACH foot）
B. 單軸式（Single-axis foot）
C. 多軸式（Multiple-axis foot）
D. 費式（Flex foot）

正確答案：D. 費式（Flex foot）